Clinical trial inclusion criterion:
Moderate to severe pain (NVS>4).

Annotated entities:
- Condition: "pain"
- Measurement: "NVS"
- Value: ">4)"
- Qualifier: "severe"
- Qualifier: "Moderate"